藉由改善飲用水系統最能達到防治下列何種寄生蟲之感染？
A. 旋毛蟲（Trichinella spiralis）
B. 麥地那線蟲（Dracunculus medinensis）
C. 廣節裂頭絛蟲（Diphyllobothrium latum）
D. 廣東住血線蟲（Angiostrongylus cantonensis）

正確答案：B. 麥地那線蟲（Dracunculus medinensis）